Clinical trial exclusion criterion:
Current therapy with Insulin, thiazolidinediones, steroids or atypical antipsychotic medication

Annotated entities:
- Drug: "Insulin"
- Drug: "thiazolidinediones"
- Drug: "steroids"
- Drug: "atypical antipsychotic medication"